Clinical trial inclusion criterion:
2. Patients who are eligible for coronary revascularization (angioplasty or CABG);

Annotated entities:
- Procedure: "coronary revascularization"
- Mood: "eligible for"
- Procedure: "angioplasty"
- Procedure: "CABG"